下列何者是 metoclopromide 治療胃輕癱（gastroparesis）之作用機轉？
A. 直接作用在平滑肌促進胃腸蠕動
B. 促進胃腸 myenteric plexus 釋放 acetylcholine
C. 促進胃腸釋放 guanylate cyclase
D. 作用在中樞神經系統

正確答案：B. 促進胃腸 myenteric plexus 釋放 acetylcholine